Clinical trial exclusion criterion:
Malignancy

Annotated entities:
- Condition: "Malignancy"